Clinical trial exclusion criterion:
Uncontrolled hyperlipidemia;

Annotated entities:
- Qualifier: "Uncontrolled"
- Condition: "hyperlipidemia"